關於白喉棒狀桿菌（Corynebacterium diphtheriae）之敘述，下列何者正確？
A. 為革蘭氏陰性桿菌
B. 其主要毒力因子為一種A-B 毒素
C. 貓、狗等動物為主要傳染源
D. 主要經由食物傳染

正確答案：B. 其主要毒力因子為一種A-B 毒素